Clinical trial exclusion criterion:
Contraindication to administration of Gadolinium (Gd) based contrast agents (GBCA):

Annotated entities:
- Drug: "Gadolinium (Gd) based contrast agents (GBCA)"
- Condition: "Contraindication"